下列何者需要被吸收進入胃壁細胞並堆積在其小管內之後，其代謝轉換的產物才具有不可逆地抑制H+/K+-ATPase的藥理作用？
A. metoclopramide
B. cimetidine
C. diphenoxylate
D. esomeprazole

正確答案：D. esomeprazole